Clinical trial inclusion criterion:
Able to complete full wrist flexion-extension bilaterally

Entity relations:
- Has_mood("complete full wrist flexion-extension bilaterally", "Able to")